有關老年人外傷處置的敘述，下列何者錯誤？
A. 老年人發生硬腦膜下出血（subdural hemorrhage）的機率比硬腦膜上出血（epidural hemorrhage）機會高
B. 必要時，應及早輸血
C. 胸部挫傷時，發生院內感染的機率比年輕人高
D. 生命徵象變化容易預測

正確答案：D. 生命徵象變化容易預測